patients with stable coronary artery disease referred to PCI in an artery suitable for IVUS pullback;

The above is a clinical trial inclusion criterion. Annotated with entity spans:
patients with [Qualifier: stable] [Condition: coronary artery disease] [Mood: referred to] [Procedure: PCI] in an [Qualifier: artery suitable for IVUS pullback];